What is the link between Dax1 and Esrrb?

Dax1 associates with Esrrb and regulates its function in embryonic stem cells